Clinical trial inclusion criterion:
Age >18 years.

Annotated entities:
- Person: "Age"
- Value: ">18 years"